A history of having inadequate response to adequate SSRIs or CBT treatment

The above is a clinical trial exclusion criterion. Annotated with entity spans:
A history of having [Qualifier: inadequate] [Condition: response] to adequate [Drug: SSRIs] or [Drug: CBT] treatment